下列關於心電圖（electrocardiogram,ECG or EKG）監測的敘述，何者錯誤？
A. 手術麻醉中病患心電圖的監測是必要項目，也是標準監測中的一項
B. 心電圖監測的主要目的是要偵測出會影響心臟機械性功能的電氣性障礙（electrical
C. 對於心律不整和心肌缺血的正確診斷，有助於正確有效的臨床處置之擬定與執行
D. 由於電導（ECG leads）的簡化，大部分的心律不整和心肌缺血無法由心電圖監測器診斷發現

正確答案：D. 由於電導（ECG leads）的簡化，大部分的心律不整和心肌缺血無法由心電圖監測器診斷發現